Which key gene is involved in syndromic obesity phenotype of patients with 1p21.3 microdeletions?

MIR137 is the key gene mediator of the syndromic obesity phenotype of patients with 1p21. 3 microdeletions.